Clinical trial exclusion criterion:
Current TB or TB treatment in = 6 months (contain active antibiotics against Orientia spp.)

Entity relations:
- Has_temporal("TB treatment", "in = 6 months")
- OR("TB", "TB treatment")